hypogonadotropic hypogonadism,

The above is a clinical trial exclusion criterion. Annotated with entity spans:
[Condition: hypogonadotropic hypogonadism],